以下何種心臟疾病患者不宜參與心臟復健訓練？
A. 正位心臟移植
B. 急性不穩定心絞痛
C. 安裝心臟節律器
D. 已接受心臟瓣膜置換手術之風濕性心臟病

正確答案：B. 急性不穩定心絞痛